30歲女性，G1P0，妊娠36週，胎兒呼吸次數於30分鐘超音波監視下有五次，每次持續30秒以上，依胎兒生物生理計分法（biophysical profile），於胎兒呼吸分項下得分為何？
A. 0
B. 1
C. 2
D. 3

正確答案：C. 2